Clinical trial exclusion criterion:
absence of affiliation to social security

Entity relations:
- Has_negation("affiliation to social security", "absence")